What are DMARDs?

DMARDs are Disease Modifying anti-rheumatic drugs (DMARD).